Clinical trial inclusion criterion:
A life expectancy of at least 3 months;

Annotated entities:
- Observation: "life expectancy"
- Value: "at least 3 months"